Primary diagnosis other than GAD

The above is a clinical trial inclusion criterion. Annotated with entity spans:
[Condition: Primary diagnosis] [Negation: other than] [Condition: GAD]